Describe the Enhancing NeuroImaging Genetics through Meta-Analysis (ENIGMA) Consortium

The ENIGMA Consortium is a collaborative network of researchers working together on a range of large-scale studies that integrate data from 70 institutions worldwide. Organized into Working Groups that tackle questions in neuroscience, genetics, and medicine, EnIGMA studies have analyzed neuroimaging data from over 12,826 subjects. By meta-analyzing results from many sites, they have detected factors that affect the brain that no individual site could detect on its own, and that require larger numbers of subjects than any individual study has currently collected.